32歲男性病人，因反覆發作葡萄膜炎（uveitis）從眼科轉診過來；詳細病史，發現其已有一年多常有口腔潰瘍疼痛的病史，且兩下肢也時常出現有壓痛的皮膚紅疹。但無慢性下背痛的病史，下列那一項檢查，可能具診斷的價值？
A. pathergy test
B. Schober test
C. Schirmer's test
D. PPD skin test

正確答案：A. pathergy test